What is the role of TNF in obesity?

Macrophage TNF-alpha contributes to insulin resistance and hepatic steatosis in diet-induced obesity.